36歲女性20年來每天抽一包菸，發現自己右側乳房乳暈旁皮膚紅腫熱痛，乳暈下有一腫塊，做切片檢查發現乳小管上皮有明顯	狀上皮化生，乳小管被角質堵塞而擴張成囊狀，乳小管旁有明顯肉芽腫樣發炎反應。則下列何者為最可能之診斷？
A. 管內乳突狀瘤（intraductal papilloma）
B. 急性乳房炎（acute mastitis）
C. 分枝桿菌感染（mycobacterial infection）
D. 周邊乳腺管性乳房炎（periductal mastitis）

正確答案：D. 周邊乳腺管性乳房炎（periductal mastitis）